Clinical trial inclusion criterion:
6. ECOG performance status of 0 to 2

Annotated entities:
- Measurement: "ECOG performance status"
- Value: "0 to 2"